Clinical trial exclusion criterion:
Hemoglobin <10 g/dL

Annotated entities:
- Measurement: "Hemoglobin"
- Value: "<10 g/dL"